En contabilidad, ¿cuál de los siguientes elementos debe incluirse en el PASIVO de un patrimonio?
1. Créditos a favor de terceros.
2. Cantidades que deben los clientes.
3. Dinero en bancos.
4. Dinero en entidades de crédito.
5. El local.

Respuesta correcta: 1. Créditos a favor de terceros.